What is the effect of Chk2 splice variants on wild-type Chk2 kinase activity?

Chk2 splice variants have been demonstrated to exert a dominant-negative effect on wild-type Chk2 kinase activity.